What is the TALE-iD method used for?

TALE-iD is a methylation-based method for the study of native chromatin structure.